Clinical trial inclusion criterion:
known anemia (hemoglobin <10 g/dL) at the time of screening

Entity relations:
- Has_value("hemoglobin", "<10 g/dL")
- Subsumes("anemia", "hemoglobin")
- Has_index("at the time of screening", "the time of screening")
- Has_temporal("anemia", "at the time of screening")